What is STATegra?

STATegra is a comprehensive multi-omics dataset of B-cell differentiation in mouse. It combines measurements from up to 10 different omics technologies applied to the same biological system, namely the well-studied mouse pre-B-cell differentiation. STATegra includes high-throughput measurements of chromatin structure, gene expression, proteomics and metabolomics, and it is complemented with single-cell data.